Pregnancy, giving birth within the last 90 days, or lactation

The above is a clinical trial inclusion criterion. Annotated with entity spans:
[Pregnancy_considerations: Pregnancy, giving birth within the last 90 days, or lactation]